Clinical trial exclusion criterion:
Use of prohibited medications, in particular, agents known to be nephrotoxic or drugs slow in renal excretion.

Annotated entities:
- Qualifier: "nephrotoxic"
- Procedure: "agents"
- Procedure: "drugs"
- Qualifier: "slow in renal excretion"
- Undefined_semantics: "Use of prohibited medications"